Partial thromboplastin time (PTT) must be </= 1.5 x upper normal limit of institution's normal range and INR (International Normalized Ratio) < 1.5.

The above is a clinical trial inclusion criterion. Annotated with entity spans:
[Measurement: Partial thromboplastin time (PTT)] must be [Value: </= 1.5 x upper normal limit] of institution's normal range and [Measurement: INR (International Normalized Ratio)] [Value: < 1.5].